Bilateral total knee arthroplasty

The above is a clinical trial exclusion criterion. Annotated with entity spans:
[Procedure: Bilateral total knee arthroplasty]